足月出生六個月大之男嬰，經身體診查發現四肢短小，頭圍正常，前囟門大，眼瞼水腫，皮膚乾燥且黃疸，頭髮粗糙，下列何者為最正確之診斷？
A. 先天性甲狀腺低能症（congenital hypothyroidism）
B. 先天性甲狀腺亢進症（congenital hyperthyroidism）
C. 純母奶餵食且餵食量不足
D. 新生兒高黃疸（hyperbilirubinemia）之併發症

正確答案：A. 先天性甲狀腺低能症（congenital hypothyroidism）